Clinical trial exclusion criterion:
Untreated thyroid disease;

Annotated entities:
- Condition: "thyroid disease"
- Qualifier: "Untreated"